下列那一種抗癲癇藥物不能使用於失神性癲癇（小發作）的治療？
A. ethosuximide
B. valproate
C. phenytoin
D. lamotrigine

正確答案：C. phenytoin